Clinical trial inclusion criterion:
Males and females with confirmed disease: Fabry (by GLA enzymes and/or DNA testing) naïve and on ERT, Mitochondrial diseases (electron transport chain and/or DNA testing) or connective tissue diseases (clinical criteria and/or DNA testing when available)

Annotated entities:
- Person: "Males"
- Person: "females"
- Grammar_Error: "and"
- Qualifier: "Fabry naïve"
- Procedure: "ERT"
- Procedure: "GLA enzymes"
- Procedure: "DNA testing"
- Condition: "confirmed disease"
- Context_Error: "confirmed disease"
- Condition: "Mitochondrial diseases"
- Procedure: "electron transport chain"
- Procedure: "DNA testing"
- Condition: "connective tissue diseases"
- Procedure: "DNA testing"
- Observation: "clinical criteria"
- Context_Error: "Fabry naïve"